Clinical trial exclusion criterion:
Life expectancy <12 months

Annotated entities:
- Observation: "Life expectancy"
- Value: "<12 months"